Undergoing elective primary, revision, or second stage re-implantation total or uni compartmental knee replacement;

The above is a clinical trial inclusion criterion. Annotated with entity spans:
Undergoing [Qualifier: elective] [Qualifier: primary], [Qualifier: revision], or [Qualifier: second stage re-implantation total] or [Qualifier: uni compartmental] [Procedure: knee replacement];